Clinical trial exclusion criterion:
Concomitant participation in other clinical trials

Annotated entities:
- Temporal: "Concomitant"
- Observation: "participation in other clinical trials"